Use of immunoglobulin in the past 12 months before the study vaccination;

The above is a clinical trial exclusion criterion. Annotated with entity spans:
Use of [Drug: immunoglobulin] [Temporal: in the past 12 months before the study vaccination];